Clinical trial exclusion criterion:
Women with multi-fetal pregnancy, diabetes mellitus, chronic hypertension, or chronic renal disease

Entity relations:
- OR("multi-fetal pregnancy", "chronic renal disease", "diabetes mellitus", "chronic hypertension")